Clinical trial exclusion criterion:
Children who present to the PED with a rash, vomiting or current asthma symptoms including coughing, wheezing or breathing problems will also be excluded to ensure these do not mask reactions to an oral challenge.

Entity relations:
- Subsumes("asthma symptoms", "coughing")
- Has_temporal("asthma symptoms", "current")
- OR("coughing", "breathing problems", "wheezing")
- OR("rash", "asthma symptoms", "vomiting")